有關反覆性尿路感染的敘述，下列何者正確？
A. 反覆性尿路感染的女孩，一定會有尿路系統解剖學上的異常
B. 反覆性尿路感染的女孩，常會有憋尿、少喝水的習慣以及便秘
C. 如果沒有發燒症狀，尿路感染並不需要治療
D. 膀胱輸尿管尿液逆流，並不是造成反覆性尿路感染的原因

正確答案：B. 反覆性尿路感染的女孩，常會有憋尿、少喝水的習慣以及便秘